Use of concomitant antimicrobials in the first 4 days after enrolment with known activity against Gram-negative bacilli (except trimethoprim/sulphamethoxazole may be continued as Pneumocystis prophylaxis).

The above is a clinical trial exclusion criterion. Annotated with entity spans:
Use of [Qualifier: concomitant] [Drug: antimicrobials] in the [Temporal: first 4 days after enrolment] with known activity against [Observation: Gram-negative bacilli] ([Negation: except] t[Drug: rimethoprim/sulphamethoxazole] may be continued as Pneumocystis prophylaxis).